Primary psychiatric diagnosis of Major Depressive Disorder, without psychotic features, confirmed via SCID-IV structured diagnostic interview.

The above is a clinical trial inclusion criterion. Annotated with entity spans:
[Qualifier: Primary] psychiatric diagnosis of [Condition: Major Depressive Disorder], [Negation: without] [Condition: psychotic features], confirmed via SCID-IV structured diagnostic interview.